Which X chromosome abnormalities present lupus-like symptoms?

yaa